Unable or unwilling to undergo a 7 day washout period if currently being treated with deferiprone or deferoxamine or deferasirox;

The above is a clinical trial exclusion criterion. Annotated with entity spans:
[Post-eligibility: Unable or unwilling to undergo a 7 day washout period if currently being treated with deferiprone or deferoxamine or deferasirox];